有關下列不同失語症（aphasia）患者之預後，何者最差？
A. 說話流暢，但答非所問，併有保存（preservation）現象
B. 說話不流暢，可理解指令，但需費力（effort）說話
C. 說話流暢，理解正常，但命名（naming）困難
D. 說話不流暢，可理解指令，伹有電報式語言（telegraphic speech）

正確答案：A. 說話流暢，但答非所問，併有保存（preservation）現象